Clinical trial exclusion criterion:
History of genetically inherited progressive CNS degenerative disorder (e.g., hereditary paraparesis; MELAS [mitochondrial myopathy, encephalopathy, lactic acidosis, stroke] syndrome)

Entity relations:
- Has_qualifier("progressive CNS degenerative disorder", "genetically inherited")
- Subsumes("MELAS syndrome", "mitochondrial myopathy")
- Subsumes("progressive CNS degenerative disorder", "hereditary paraparesis")
- Subsumes("MELAS syndrome", "encephalopathy")
- Subsumes("MELAS syndrome", "lactic acidosis")
- Subsumes("MELAS syndrome", "stroke")
- OR("hereditary paraparesis", "MELAS syndrome")